En una mujer que presenta hiperemesis gravídica, se debe vigilar la aparición de:
1. Crisis convulsivas.
2. Hiperglucemia.
3. Deshidratación.
4. Abruptio placentae.
5. Poliuria.

Respuesta correcta: 3. Deshidratación.